Clinical trial exclusion criterion:
Current treatment with drugs interfering with CYP3A4 metabolism (to avoid interaction with ticagrelor): Ketoconazole, itraconazole, voriconazole, clarithromycin, nefazodone, ritonavir, saquinavir, nelfinavir, indinavir, atazanavir, and telithromizycin.

Annotated entities:
- Drug: "drugs"
- Condition: "CYP3A4 metabolism"
- Drug: "ticagrelor"
- Mood: "interfering with"
- Drug: "Ketoconazole"
- Non-query-able: "to avoid interaction with ticagrelor"
- Drug: "itraconazole"
- Drug: "voriconazole"
- Drug: "clarithromycin"
- Drug: "nefazodone"
- Drug: "ritonavir"
- Drug: "saquinavir"
- Drug: "nelfinavir"
- Drug: "indinavir"
- Drug: "atazanavir"
- Drug: "telithromizycin"